Patients with bleeding disorders including vonWillebrand disease type I.

The above is a clinical trial exclusion criterion. Annotated with entity spans:
Patients with [Condition: bleeding disorders] including [Condition: vonWillebrand disease type I].